有關黏膜免疫系統與由脾臟／淋巴結所構成的系統性免疫系統之比較，下列敘述何者錯誤？
A. 即使在缺乏感染之情形下，前者主要由活化的 T 細胞或是記憶型 T 細胞所構成
B. 前者抗原進入的路徑與後者類似，主要是透過血流或是皮下進入
C. 前者的免疫細胞與上皮細胞有密切接觸
D. 前者時常暴露在無害抗原之下，所以發展出很好的抑制免疫反應的調控機制

正確答案：B. 前者抗原進入的路徑與後者類似，主要是透過血流或是皮下進入